Clinical trial exclusion criterion:
Major surgery within 6 weeks

Entity relations:
- Has_temporal("Major surgery", "within 6 weeks")